Subject must have been on maintenance therapy (Fixed dose combination ICS/LABA) for 3 months, cannot have changed dose in the month prior to screening and be able to change to an equivalent dose of RELVAR/BREO for the duration of the study. Other background asthma medication such as anti-leukotrienes and oral corticosteroids are permitted provided the dose has been stable for 1 month prior to screening.

The above is a clinical trial inclusion criterion. Annotated with entity spans:
Subject must have been on [Procedure: maintenance therapy] ([Multiplier: Fixed dose] [Drug: combination ICS/LABA]) [Temporal: for 3 months], [Negation: cannot] have [Multiplier: changed dose] [Temporal: in the month prior to screening] [Non-representable: and be able to change to an equivalent dose of RELVAR/BREO for the duration of the study. Other background asthma medication such as anti-leukotrienes and oral corticosteroids are permitted provided the dose has been stable for 1 month prior to screening].